黃先生 32 歲，無高血壓，但經常有運動性呼吸困難。心電圖顯示左心室肥大，心臟超音波檢查發現瓣膜無特殊變化，左心室中隔及左心室下壁肥厚，左心室腔室（chamber）縮小但收縮功能正常、舒張功能不正常，左心室排出道（outflow tract）無壓力差，則其診斷是：
A. 主動脈瓣狹窄
B. 主動脈閉鎖不全
C. 肥厚型心肌病（hypertrophic cardiomyopathy）
D. 左心室心尖部肥厚（apical hypertrophy）

正確答案：C. 肥厚型心肌病（hypertrophic cardiomyopathy）